Having life expectancy less than 1 year

The above is a clinical trial exclusion criterion. Annotated with entity spans:
Having [Observation: life expectancy] [Value: less than 1 year]